El lipopolisacárido bacteriano:
1. Contribuye a neutralizar la carga negativa de la membrana.
2. Tiene una cadena O constituida por ácidos de cadena larga.
3. Contribuye a crear una barrera de permeabilidad.
4. Es un tipo de exotoxina.

Respuesta correcta: 3. Contribuye a crear una barrera de permeabilidad.